Clinical trial exclusion criterion:
Ductal carcinoma in situ (DCIS; stage 0 cancer),

Entity relations:
- AND("cancer", "stage")
- Has_value("stage", "0")
- Subsumes("Ductal carcinoma in situ", "DCIS")
- OR("DCIS", "cancer")